Manuel es un paciente diagnosticado de enfermedad de Parkinson desde hace unos años, en la actualidad se encuentra en fase III de la enfermedad. En dicha fase, ¿qué nivel de discapacidad presenta Manuel?:
1. Grave, confinado en cama.
2. Afectación bilateral sin deterioro del equilibrio.
3. Con signos de deterioro del equilibrio, pero físicamente capaz de tener una vida independiente.
4. Manuel puede caminar y permanecer de pie sin ayuda pero presenta una discapacidad notable.

Respuesta correcta: 3. Con signos de deterioro del equilibrio, pero físicamente capaz de tener una vida independiente.